patients undergoing other bariatric procedures

The above is a clinical trial exclusion criterion. Annotated with entity spans:
patients [Temporal: undergoing] [Qualifier: other] [Procedure: bariatric procedures]